下列關於緊急經皮呼吸道（percutaneous airway）處置技術的敘述，何者錯誤？
A. 當非侵犯性呼吸道（noninvasive airway）處置技術無法插管，無法通氣（cannot intubate, cannot ventilate），且嚴重的缺氧狀態持續惡化時，要立即採取緊急經皮呼吸道處置
B. 以技術層面的選擇而言，緊急氣管切開術（tracheotomy）應該優先於緊急環甲軟骨切開術
C. 氣管切開術貫穿呼吸道的部位在氣管前壁，而環甲軟骨切開術的貫穿部位在環甲膜
D. 臨床上無法以血氧飽和濃度（oxygen saturation）來界定啟動緊急經皮呼吸道處置的時機，因為使用時機和缺氧程度以及惡化的速度有關

正確答案：B. 以技術層面的選擇而言，緊急氣管切開術（tracheotomy）應該優先於緊急環甲軟骨切開術